Clinical trial exclusion criterion:
Severe hepatic dysfunction, defined as:

Entity relations:
- Has_qualifier("hepatic dysfunction", "Severe")